2. Women of childbearing potential must practice abstinence or be using an acceptable form of contraception throughout the duration of the study. Acceptable forms of contraception include the following:

The above is a clinical trial inclusion criterion. Annotated with entity spans:
2. [Person: Women] of [Condition: childbearing potential] must practice [Procedure: abstinence] or be using an [Qualifier: acceptable form] of [Procedure: contraception] [Temporal: throughout the duration of the study]. Acceptable forms of contraception include the following: